thyroid dysfunction, with serum TSH out of normal limits

The above is a clinical trial exclusion criterion. Annotated with entity spans:
[Condition: thyroid dysfunction], with [Measurement: serum TSH] [Value: out of normal limits]